infertility,

The above is a clinical trial inclusion criterion. Annotated with entity spans:
[Condition: infertility],